Clinical trial inclusion criterion:
Written informed consent obtained from the subject.

Annotated entities:
- Observation: "Written informed consent"